mild gastrointestinal symptom

The above is a clinical trial inclusion criterion. Annotated with entity spans:
[Qualifier: mild] [Condition: gastrointestinal symptom]